Greater than 12 months from spinal cord injury

The above is a clinical trial exclusion criterion. Annotated with entity spans:
[Temporal: Greater than 12 months] from [Condition: spinal cord injury]